What fruit causes Jamaican vomiting sickness?

Jamaican Vomiting Sickness is caused by ingestion of the unripe arils of the Ackee fruit, its seeds and husks.